下列敘述有關結締組織疾病侵犯肺部的病理變化，何者錯誤？
A. 類風濕性關節炎可以表現慢性肋膜炎
B. 硬皮病表現尋常間質肺炎較非特異性間質肺炎常見
C. 紅斑性狼瘡可以表現狼瘡肺炎
D. 肺高血壓可見於類風濕性關節炎侵犯肺部

正確答案：B. 硬皮病表現尋常間質肺炎較非特異性間質肺炎常見